Acid-fast stain 是用於觀察下列那一種感染原的染色方法？
A. Listeria monocytogenes
B. Treponema pallidum
C. Mycobacterium tuberculosis
D. Chlamydia trachomatis

正確答案：C. Mycobacterium tuberculosis